Immune suppressive treatment within the previous 6 months

The above is a clinical trial exclusion criterion. Annotated with entity spans:
[Procedure: Immune suppressive treatment] [Temporal: within the previous 6 months]